What is the mechanism of action of  trichostatin A (TSA) as an antitumoral agent?

Trichostatin A (TSA) exerts antitumoral activity as a histone deacetylase inhibitor